Al trastorno degenerativo del cerebro que produce un declive gradual en la función intelectual, siendo los problemas de memoria unos de los primeros síntomas, se denomina:
1. Amnesia anterógrada.
2. Demencia.
3. Delirium.
4. Amnesia funcional.

Respuesta correcta: 2. Demencia.